Clinical trial exclusion criterion:
Amiodarone. Subjects previously treated with amiodarone must have stopped the amiodarone at least 60 days prior to day 1 of SOF/LDV FDC

Entity relations:
- Has_index("at least 60 days prior to day 1 of SOF/LDV FDC", "day 1 of SOF/LDV FDC")
- Has_temporal("Amiodarone", "at least 60 days prior to day 1 of SOF/LDV FDC")